Clinical trial inclusion criterion:
Gender: male or female;

Entity relations:
- Has_value("Gender", "male")
- OR("male", "female")